臨床上測量有無尿道過度移動（urethral hypermobility），常會作cotton swab test 並使用測角器（goniometer）來測量尿道靜止及移動角度變化，下列何者為診斷尿道過度移動的準則（criteria）？
A. a resting urethral angle > 30 degrees or a maximal straining angle > 30 degrees
B. a resting urethral angle > 30 degrees and a maximal straining angle > 30 degrees
C. a resting urethral angle > 30 degrees or a maximal straining angle > 45 degrees
D. a resting urethral angle > 30 degrees and a maximal straining angle > 45 degrees

正確答案：A. a resting urethral angle > 30 degrees or a maximal straining angle > 30 degrees